Clinical trial exclusion criterion:
pancreatic polypeptide producing endocrine tumor

Annotated entities:
- Condition: "pancreatic polypeptide producing endocrine tumor"